Clinical trial inclusion criterion:
Age between 18 and 78 year-old.

Entity relations:
- Has_value("Age", "between 18 and 78 year-old")